DSM-IV-TR substance-related disorders (except nicotine)

The above is a clinical trial exclusion criterion. Annotated with entity spans:
[Qualifier: DSM-IV-TR] [Condition: substance-related disorders] ([Negation: except] [Drug: nicotine])